58 歲男性，有酒精成癮症及鬱血性心臟衰竭，過去幾個月覺得神智不清、失去方向感、行動困難，就醫時理學檢查有眼球顫動、步態失調、下肢感覺神經變差，實驗檢查血紅素及各血球數大致正常。 請問該病人最有可能長期缺乏下列何種營養素所引起？
A. 菸鹼酸
B. 維他命 B6
C. 葉酸
D. 維他命 B1

正確答案：D. 維他命 B1